Allergy to porphyrins and analogues; Photosensitivity; Porphyria; Allergic constitution;

The above is a clinical trial exclusion criterion. Annotated with entity spans:
[Condition: Allergy] to [Drug: porphyrins] and [Drug: analogues]; [Condition: Photosensitivity]; [Condition: Porphyria]; [Condition: Allergic constitution];